Para revertir la metahemoglobinemia inducida por tóxicos se utiliza:
1. Edetato sódico.
2. Oxígeno.
3. Azul de metileno.
4. Glutatión.

Respuesta correcta: 3. Azul de metileno.